一位 73 歲男性數度發生呼吸困難，並出現心包囊及肋膜腔積水，影像學檢查發現肝腫大充血，尿中 mg/24 小時（正常值為 0.7-8.2 mg/24 小時）。病人後來接受肺動脈瓣及三尖瓣置換手術，下列敘述中何者最符合此病人右心瓣膜的病理變化？
A. Deposition of mucoid material in spongiosa
B. Calcification and fibrosis at the base of valves
C. Plaque-like intimal thickening and smooth muscle cell proliferation
D. Subendocardial accumulation of elastic fibers

正確答案：C. Plaque-like intimal thickening and smooth muscle cell proliferation